Anticipated postoperative positive pressure ventilation

The above is a clinical trial exclusion criterion. Annotated with entity spans:
[Mood: Anticipated] [Temporal: postoperative] [Procedure: positive pressure ventilation]